Clinical trial exclusion criterion:
documented allergy to iodine or shellfish

Annotated entities:
- Condition: "allergy"
- Drug: "iodine"
- Drug: "shellfish"